Clinical trial exclusion criterion:
A history of substance abuse and/or dependence.

Entity relations:
- OR("substance abuse", "substance dependence")